Clinical trial exclusion criterion:
Past medical history of dysphagia or aspiration pneumonia

Entity relations:
- Has_temporal("dysphagia", "Past medical history")
- OR("dysphagia", "aspiration pneumonia")